Muy comúnmente las moléculas de autoinductor responsables de la percepción del quórum de muchas bacterias Gram-negativas son:
1. N-acil homoserina lactonas.
2. Ácido diaminopimélico.
3. Proteínas.
4. Colinas.
5. Ácidos grasos.

Respuesta correcta: 1. N-acil homoserina lactonas.